Patients with chronic pain requiring treatment, with a known allergy to paracetamol, or concomitant use of non-steroidal anti-inflammatories , oral anticoagulants or corticosteroids.

The above is a clinical trial exclusion criterion. Annotated with entity spans:
Patients with [Condition: chronic pain] [Qualifier: requiring treatment], with a [Condition: known allergy] to [Drug: paracetamol], or [Temporal: concomitant] use of [Drug: non-steroidal anti-inflammatories] , [Drug: oral anticoagulants] or [Drug: corticosteroids].